Which are the lactate isomers?

Lactate contains a chiral carbon and thus has two optical isomers-d-lactate and l-lactate.